一位 55 歲男性因漸進性吞嚥困難及三個月體重減輕 10 公斤就診，接受一系列檢查顯示為食道下段腺癌（adenocarcinoma）。下列何者與此病的發生最有關？
A. 胃食道逆流
B. 烈酒
C. 抽菸
D. 熱食

正確答案：A. 胃食道逆流